Clinical trial inclusion criterion:
Without basal disorders of neurology and psychiatrics

Annotated entities:
- Condition: "basal disorders of neurology"
- Condition: "basal disorders of psychiatrics"
- Negation: "Without"